Significant medical problem that in the opinion of the investigator would preclude enrollment in this study

The above is a clinical trial exclusion criterion. Annotated with entity spans:
S[Non-query-able: ignificant medical problem that in the opinion of the investigator would preclude enrollment in this study]